33 歲婦女順利生產一男嬰，但此嬰兒出生即呈嚴重發紺，給予純氧亦無法改善其發紺症狀。影像學顯示心室中隔並無缺陷，主動脈位於肺動脈幹之右前方，右心室呈肥大狀。下列先天性心臟病中，何者最符合病人的臨床及病理特徵？
A. Tetralogy of Fallot
B. Transposition of great arteries
C. Tricuspid atresia
D. Truncus arteriosus

正確答案：B. Transposition of great arteries